Clinical trial exclusion criterion:
Inability to give informed consent

Annotated entities:
- Informed_consent: "Inability to give informed consent"